undergoing unilateral mastectomy with or without axillary node dissection

The above is a clinical trial inclusion criterion. Annotated with entity spans:
[Temporal: undergoing] [Measurement: unilateral mastectomy] with or without [Procedure: axillary node dissection]